Clinical trial exclusion criterion:
untreaed hyperprolactinemia

Entity relations:
- Has_qualifier("hyperprolactinemia", "untreaed")